Concomitant use with oral anticoagulant drugs

The above is a clinical trial exclusion criterion. Annotated with entity spans:
[Temporal: Concomitant] use with [Drug: oral anticoagulant drugs]